Clinical trial exclusion criterion:
coagulopathies including platelet count of less than 100,000

Entity relations:
- Has_value("platelet count", "less than 100,000")
- AND("coagulopathies", "platelet count")